significant symptomatic cardiac disease

The above is a clinical trial inclusion criterion. Annotated with entity spans:
[Qualifier: significant] [Qualifier: symptomatic] [Condition: cardiac disease]